下列病人何者不適合做心臟移植？
A. 嚴重且反覆的心臟衰竭症狀，且左心室射出率（ejection fraction, LVEF）<20%
B. 嚴重心肌缺血無法以傳統冠狀動脈繞道手術治療者
C. 心臟衰竭已使用葉克膜（ECMO）等心臟輔助器，且無法斷離者
D. 複雜的先天性心臟病，可以用傳統手術矯正者

正確答案：D. 複雜的先天性心臟病，可以用傳統手術矯正者